下列有關基因轉送載體 herpes simplex virus-1 之敘述，何者正確？
A. 其常整合入標的細胞的染色體
B. 可攜帶 20-30 kb 之 DNA
C. 只可應用於分裂中的細胞
D. 有預先存在之宿主對載體的免疫反應

正確答案：B. 可攜帶 20-30 kb 之 DNA